History of thrombophilia or anticoagulant therapy

The above is a clinical trial exclusion criterion. Annotated with entity spans:
History of [Condition: thrombophilia] or [Drug: anticoagulant therapy]